patients undergoing invasive procedures via the radial or femoral arteries

The above is a clinical trial inclusion criterion. Annotated with entity spans:
patients [Temporal: undergoing] [Procedure: invasive procedures] via the [Qualifier: radial] or [Qualifier: femoral arteries]